Clinical trial inclusion criterion:
HIV negative

Annotated entities:
- Measurement: "HIV"
- Value: "negative"